Clinical trial exclusion criterion:
Allergy to rosuvastatin or parvastatin

Entity relations:
- AND("Allergy", "rosuvastatin")
- OR("rosuvastatin", "parvastatin")